Possible or probable Alzheimer's disease (National Institute of Neurological and Communicative Disorders and Stroke - Alzheimer's Disease and Related Disorders Association (NINCDS-ADRDA) criteria), with Mini-Mental State Exam (MMSE) score of 10-26 inclusive; MMSE scores above 26 in those who nevertheless meet criteria for AD may be allowed with Steering Committee approval on a case by case basis

The above is a clinical trial inclusion criterion. Annotated with entity spans:
[Value: Possible] or [Value: probable] [Condition: Alzheimer's disease] ([Measurement: National Institute of Neurological and Communicative Disorders and Stroke - Alzheimer's Disease and Related Disorders Association (NINCDS-ADRDA) criteria]), with [Measurement: Mini-Mental State Exam (MMSE)] [Value: score of 10-26 inclusive]; [Measurement: MMSE] [Value: scores above 26] in those who nevertheless meet criteria for [Condition: AD] may be allowed with Steering Committee approval on a case by case basis